Clinical trial exclusion criterion:
WHO group II, III, IV, V PH

Annotated entities:
- Measurement: "WHO"
- Value: "group II, III, IV, V"
- Condition: "PH"